Clinical trial exclusion criterion:
Any known history of hypersensitivity to interferon.

Entity relations:
- AND("hypersensitivity", "interferon")